4. self-reported failure of eccentric exercise protocol (at least 75% completion)

The above is a clinical trial inclusion criterion. Annotated with entity spans:
4. [Observation: self-reported] [Condition: failure of eccentric exercise protocol] ([Value: at least 75%] completion)